En un paciente diagnosticado de diabetes insípida central idiopática esperamos encontrar (antes de iniciar tratamiento alguno):
1. Osmolalidad plasmática elevada, natremia alta, osmolalidad urinaria aumentada.
2. Osmolalidad plasmática baja, natremia alta, osmolalidad urinaria aumentada.
3. Osmolalidad plasmática elevada, natremia alta, osmolalidad urinaria disminuida.
4. Osmolalidad plasmática baja, natremia baja, osmolalidad urinaria aumentada.

Respuesta correcta: 3. Osmolalidad plasmática elevada, natremia alta, osmolalidad urinaria disminuida.